有關次發性高血壓的敘述，何者正確？
A. 腎血管狹窄引起的血壓高是所有次發性高血壓裡面最常見的
B. 腎動脈發生纖維肌肉發育異常（Fibromuscular dysplasia）或是動脈硬化形成斑塊，引起血管狹窄，造成血壓高
C. 腎上腺腫瘤製造過多的Aldosterone也是造成次發性高血壓的原因，表現常是：鈉堆積，高血壓，高血鉀，低的血中腎素（Renin）活性
D. 嗜鉻細胞瘤（Pheochromocytoma）有80%的機會是來自家族遺傳，屬於自體顯性（Autosomal dominant）遺傳

正確答案：B. 腎動脈發生纖維肌肉發育異常（Fibromuscular dysplasia）或是動脈硬化形成斑塊，引起血管狹窄，造成血壓高